Clinical trial exclusion criterion:
If smoking and/or other drug addiction is present

Annotated entities:
- Observation: "smoking"
- Condition: "drug addiction"